Clinical trial inclusion criterion:
Type 1 diabetes according to ADA criterias <5 years.

Annotated entities:
- Condition: "Type 1 diabetes"
- Qualifier: "ADA criterias"
- Temporal: "<5 years"